Clinical trial inclusion criterion:
Resolution of all acute toxic effects of prior anti-cancer therapy or surgical procedures to NCI CTCAE version 4.0 grade = 1 (except alopecia or other toxicities not considered a safety risk for the patient at investigator's discretion).

Annotated entities:
- Measurement: "NCI CTCAE version 4.0"
- Value: "grade = 1"
- Observation: "Resolution"
- Condition: "acute toxic effects"
- Procedure: "anti-cancer therapy"
- Procedure: "surgical procedure"
- Qualifier: "prior"
- Negation: "except"
- Condition: "alopecia"
- Non-query-able: "except alopecia or other toxicities not considered a safety risk for the patient at investigator's discretion)"